Clinical trial exclusion criterion:
On treatment with a P2Y12 receptor antagonist (ticlopidine, clopidogrel, prasugrel, ticagrelor) in the prior 10 days

Annotated entities:
- Drug: "P2Y12 receptor antagonist"
- Drug: "ticlopidine"
- Drug: "clopidogrel"
- Drug: "prasugrel"
- Drug: "ticagrelor"
- Temporal: "prior 10 days"